Clinical trial inclusion criterion:
3. Patient treated by Eribulin between January and October 2014 (for the retrospective part) or between November 2014 and September 2015 (for the prospective part).

Entity relations:
- Has_temporal("Eribulin", "between January and October 2014")
- OR("between January and October 2014", "between November 2014 and September 2015")